La terapia de esquemas de Young para los trastornos de personalidad deriva de:
1. La terapia de aceptación y compromiso.
2. La terapia racional emotiva.
3. La terapia cognitiva de Beck.
4. La terapia de valoración cognitiva.
5. La terapia interpersonal.

Respuesta correcta: 3. La terapia cognitiva de Beck.